La polarografía es una técnica analítica que hace referencia a :
1. La absorción de radiación electromagnética.
2. La emisión de radiación electromagnética.
3. La voltametría con electrodo de mercurio.
4. La utilización de paladio como electrodo de referencia.
5. Al potencial de asimetría.

Respuesta correcta: 3. La voltametría con electrodo de mercurio.